Clinical trial exclusion criterion:
Severe neutropenia

Entity relations:
- Has_qualifier("neutropenia", "Severe")